Clinical trial inclusion criterion:
Have symptoms of no longer than 7 days at point of hospitalisation.

Entity relations:
- Has_index("no longer than 7 days at point of hospitalisation", "hospitalisation")
- Has_temporal("symptoms", "no longer than 7 days at point of hospitalisation")